Clinical trial exclusion criterion:
Active bleeding or known significant bleeding risk (e.g., gastrointestinal ulcer, malignant neoplasms, injuries or recent surgeries of the brain, spinal cord or eyes, recent intracranial bleedings, known or suspected esophagus varices, aneurysms or intraspinal or intracranial vascular abnormalities)

Annotated entities:
- Condition: "Active bleeding"
- Observation: "bleeding risk"
- Qualifier: "significant"
- Condition: "gastrointestinal ulcer"
- Condition: "malignant neoplasms"
- Condition: "injuries"
- Procedure: "surgeries"
- Qualifier: "brain"
- Qualifier: "spinal cord"
- Qualifier: "eyes"
- Condition: "intracranial bleedings"
- Condition: "esophagus varices"
- Condition: "aneurysms"
- Condition: "vascular abnormalities)"
- Qualifier: "intracranial"
- Qualifier: "intraspinal"